Clinical trial exclusion criteria:
Failure to provide informed consent
Inability to complete 400 m walk within 15 minutes without sitting or interpersonal assistance, as an indicator of disablement and likely inability to fully engage in the exercise intervention
Primary indication for ACE inhibitor use, i.e. Congestive Heart Failure, CAD, diabetes
Known hypersensitivity to ACE inhibitors
Resistant hypertension, defined as BP > 140/90, despite the use of three or more anti-hypertensive drugs
Office or average home SBP > 180 mm Hg or DBP > 110 mm Hg (Average home BP in any seven day period during trial)
Primary renal disease
Serum creatinine >2.5 mg/dL in men, or >2.0 mg/dL in women
Serum potassium >5.0 molar equivalent/L
Urinary protein > 1 on dipstick
Abnormal liver enzymes (Aspartate transaminase (AST), Alanine transaminase (ALT), or alkaline phosphatase > 2.5 times the upper limit of normal)
Severe cardiac disease, including New York Heart Association Class III or IV congestive heart failure, clinically significant aortic stenosis, history of cardiac arrest, use of a cardiac defibrillator, or uncontrolled angina
Acute myocardial infarction identified by ECG
Lives in a nursing home (persons living in assisted or independent housing will not be excluded)
Significant cognitive impairment, defined as a known diagnosis of dementia or a Mini-Mental State Examination exam score < 24
Unable to communicate because of severe hearing loss or speech disorder
Severe visual impairment, which would preclude completion of the assessments and/or intervention
Other significant co-morbid disease that would prevent participation in exercise
Planning to move out of the area during the study time frame
Simultaneous participation in another intervention trial

Annotated entities:
- Non-query-able: "Failure to provide informed consent"
- Condition: "Inability to complete 400 m walk within 15 minutes without sitting"
- Condition: "interpersonal assistance Inability to complete 400 m walk within 15 minutes without"
- Drug: "ACE inhibitor"
- Condition: "Primary indication for ACE inhibitor use"
- Condition: "Congestive Heart Failure"
- Condition: "CAD"
- Condition: "diabetes"
- Condition: "hypersensitivity to ACE inhibitors"
- Drug: "ACE inhibitors"
- Condition: "hypertension"
- Qualifier: "Resistant"
- Measurement: "BP"
- Value: "> 140/90"
- Qualifier: "despite the use of three or more anti-hypertensive drugs"
- Drug: "anti-hypertensive drugs"
- Multiplier: "three or more"
- Measurement: "SBP"
- Value: "> 180 mm Hg"
- Measurement: "DBP"
- Value: "> 110 mm Hg"
- Condition: "Primary renal disease"
- Measurement: "Serum creatinine"
- Value: ">2.5 mg/dL"
- Person: "men"
- Value: ">2.0 mg/dL"
- Person: "women"
- Measurement: "Serum potassium"
- Value: ">5.0 molar equivalent/L"
- Measurement: "Urinary protein on dipstick"
- Value: "> 1"
- Measurement: "liver enzymes"
- Measurement: "Aspartate transaminase (AST)"
- Measurement: "Alanine transaminase (ALT)"
- Measurement: "alkaline phosphatase"
- Value: "> 2.5 times the upper limit of normal"
- Value: "Abnormal"
- Condition: "cardiac disease"
- Qualifier: "Severe"
- Measurement: "New York Heart Association"
- Value: "Class III or IV"
- Condition: "congestive heart failure"
- Qualifier: "clinically significant"
- Condition: "aortic stenosis"
- Temporal: "history"
- Condition: "cardiac arrest"
- Device: "cardiac defibrillator"
- Condition: "uncontrolled angina"
- Qualifier: "New York Heart Association Class III or IV"
- Condition: "Acute myocardial infarction"
- Procedure: "ECG"
- Observation: "Lives in a nursing home"
- Condition: "cognitive impairment"
- Qualifier: "Significant"
- Condition: "dementia"
- Measurement: "Mini-Mental State Examination"
- Value: "score < 24"
- Condition: "Unable to communicate"
- Condition: "severe hearing loss"
- Condition: "speech disorder"
- Condition: "visual impairment"
- Qualifier: "Severe"
- Condition: "co-morbid disease"
- Qualifier: "significant"
- Qualifier: "that would prevent participation in exercise"
- Undefined_semantics: "that would prevent participation in exercise"
- Subjective_judgement: "that would prevent participation in exercise"
- Non-query-able: "Planning to move out of the area during the study time frame"
- Context_Error: "Planning to move out of the area during the study time frame"
- Context_Error: "Simultaneous participation in another intervention trial"
- Non-query-able: "Simultaneous participation in another intervention trial"